Clinical trial exclusion criteria:
History of intolerance to LMWHs during HD
Receiving warfarin or other oral anticoagulant
Pregnant patients

Annotated entities:
- Condition: "intolerance"
- Drug: "LMWHs"
- Procedure: "HD"
- Temporal: "during HD"
- Drug: "warfarin"
- Condition: "oral anticoagulant"
- Qualifier: "other"
- Condition: "Pregnant"